Clinical trial exclusion criterion:
are pregnant or think you might be pregnant

Entity relations:
- Has_mood("pregnant", "think you might be")
- OR("pregnant", "pregnant")